Clinical trial exclusion criterion:
Diagnosis of other functional diseases of the digestive system, such as dyskinesia of cystic duct or gallbladder, irritable bowel syndrome, etc.

Entity relations:
- Has_qualifier("functional diseases", "digestive system")
- Subsumes("functional diseases", "dyskinesia of cystic duct")
- OR("dyskinesia of cystic duct", "irritable bowel syndrome", "dyskinesia of gallbladder")